En el condicionamiento operante, un patrón de respuesta conocido como efecto de festoneado (“festón”) es típico de los programas de:
1. Razón fija.
2. Razón variable.
3. Intervalo fijo.
4. Intervalo variable.

Respuesta correcta: 3. Intervalo fijo.